Sobre el crecimiento y desarrollo de un niño sano en los primeros 18 meses de vida. ¿Cuál de los siguientes hallazgos consideraría como un signo de alarma?:
1. Pérdida del 10% del peso al nacimiento durante la primera semana de vida.
2. Persistencia del reflejo de Moro a los 2 meses.
3. Ausencia de transferencia contralateral de objetos a los 12 meses.
4. Ganancia ponderal mensual inferior a 300 g entre los 15 y 18 meses.

Respuesta correcta: 3. Ausencia de transferencia contralateral de objetos a los 12 meses.